Clinical trial exclusion criterion:
Subjects with contraindications to participation in an exercise training program

Annotated entities:
- Condition: "contraindications"
- Observation: "participation in an exercise training program"